¿Cuál de las siguientes variables es la mejor para guiar la resucitación e indica la resolución del shock en un politrumatizado?
1. Normalización de lactato.
2. Normalización de la presión arterial.
3. Normalización de la frecuencia cardiaca.
4. Normalización de la diuresis.

Respuesta correcta: 1. Normalización de lactato.